Clinical trial exclusion criterion:
Require combined surgery that may confound the results of the study;

Entity relations:
- Has_mood("combined surgery", "Require")
- Has_qualifier("combined surgery", "may confound the results of the study")